譫妄（delirium）乃是一種症候群，而非一種疾患。其主要症狀屬於下列何種障礙？
A. 意識障礙
B. 知覺障礙
C. 行為障礙
D. 思考障礙

正確答案：A. 意識障礙